Clinical trial exclusion criterion:
Currently meet Diagnostic and Statistical Manual of Mental Disorders - Fifth Edition (DSM-5) criteria for substance use disorder, or history thereof, within 12 months before dosing.

Annotated entities:
- Condition: "substance use disorder"
- Temporal: "within 12 months"
- Measurement: "Diagnostic and Statistical Manual of Mental Disorders - Fifth Edition"
- Measurement: "DSM-5"